Las siguientes enzimas participan tanto en la glocólisis como en la gluconeogénesis, EXCEPTO una que solo lo hace en la gluconeogénesis. Indique cuál es:
1. Aldolasa.
2. Fosfoglicerato quinasa.
3. Enolasa.
4. Piruvato carboxilasa.

Respuesta correcta: 4. Piruvato carboxilasa.